Which TREX mRNA export complex subunits have been implicated in neurodevelopmental disorders?

THOC1, THOC2 and THOC5 have been implicated in neurodegeneration and cancer. THOC6, THO7 and THO8 have been shown to be implicated in cancer.